Clinical trial exclusion criterion:
Patients who require intensive care unit treatment.

Annotated entities:
- Visit: "intensive care unit"